Clinical trial exclusion criterion:
Inability to swallow or issues with malabsorption

Entity relations:
- OR("Inability to swallow", "issues with malabsorption")